Clinical trial exclusion criterion:
7. History of subarachnoid hemorrhage

Entity relations:
- Has_temporal("subarachnoid hemorrhage", "History")